Clinical trial exclusion criterion:
Past or concurrent history of neoplasm other than stomach cancer, except for curatively treated non-melanoma skin cancer or in situ carcinoma of the cervix uteri

Annotated entities:
- Temporal: "history of"
- Condition: "neoplasm"
- Condition: "stomach cancer"
- Condition: "non-melanoma skin cancer"
- Condition: "in situ carcinoma of the cervix uteri"
- Procedure: "treated"
- Qualifier: "curatively"
- Negation: "other than"
- Negation: "except for"